Clinical trial exclusion criterion:
Lifetime history of Bipolar Disorder, Schizophrenia or Schizoaffective Disorder

Annotated entities:
- Condition: "Bipolar Disorder"
- Temporal: "Lifetime history"
- Condition: "Schizophrenia"
- Condition: "Schizoaffective Disorder"